在染色體微小缺失（microdeletion）的疾病中，Sotos syndrome的敘述，下列何者錯誤？
A. 為15q11 deletion
B. 過度成長（overgrowth）
C. 大頭症（macrocephaly）
D. 智能障礙（mental disabilities）

正確答案：A. 為15q11 deletion